下列何種思覺失調症（schizophrenia）的治療藥物，較無錐體外症候群(extrapyramidal syndrome)的副作用，但可能造成顆粒性白血球缺乏症（agranulocytosis）？
A. clozapine
B. haloperidol
C. chlorpromazine
D. aripiprazole

正確答案：A. clozapine